一位 62 歲男性肝癌患者入急診求醫，主訴為 8 小時前開始發燒發冷（fever and chills）。病人 1 天前才做完腫瘤栓塞（transcatheter arterial embolization）出院。體溫為 38.9℃。理學檢查發現腹部脹大，有瀰漫性壓痛（diffuse tenderness），並伴隨有輕微反彈痛（rebounding tenderness）。針對此病人的臨床表現，下列敘述何者最為適當？
A. 病人須同時符合有發燒、腹部壓痛以及意識變差三種症狀，才能懷疑有自發性細菌腹膜炎
B. 若腹水檢查發現多形核嗜中性白血球（polymorphic neutrophil）超過 250/mL，可診斷病人有自發性細菌腹膜炎
C. 此病人剛做完腫瘤栓塞，可推斷發燒現象必是由腫瘤壞疽（tumor necrosis）所造成
D. 若懷疑病人有自發性細菌腹膜炎，首選藥物為第一代頭孢菌素類抗生素（cephalosporin）加上 aminoglycoside

正確答案：B. 若腹水檢查發現多形核嗜中性白血球（polymorphic neutrophil）超過 250/mL，可診斷病人有自發性細菌腹膜炎